Clinical trial inclusion criteria:
full term singleton pregnant women
Scheduled for elective Cesarean Delivery
Aged between 18 and 40 years

Annotated entities:
- Qualifier: "singleton"
- Condition: "pregnant"
- Qualifier: "full term"
- Person: "women"
- Mood: "Scheduled for"
- Qualifier: "elective"
- Procedure: "Cesarean Delivery"
- Person: "Aged"
- Value: "between 18 and 40 years"